Tiene que repetir las pruebas metabólicas a un recién nacido de 20 días de vida. Para la punción del talón emplearía como analgésico:
1. Ibuprofeno oral.
2. Sacarosa oral.
3. Paracetamol intravenoso.
4. Fentanilo intravenoso.

Respuesta correcta: 2. Sacarosa oral.